急診告知有一位 36 歲女性，G1P0，目前懷孕 34 週，因突發性腹部劇痛及大量陰道出血被送至急診。孕婦意識清醒，血壓 190/100 mmHg，腹部呈現僵直性持續收縮，胎心音下降至每分鐘 60 下。最可能的診斷為：
A. 前置胎盤
B. 陰道裂傷
C. 胎盤早期剝離
D. 子癇症（eclampsia）

正確答案：C. 胎盤早期剝離